Administration of the licensed MF59-containing vaccines, e.g. Fluad™ or Addigrip™ or virosome-based influenza vaccines such as Inflexal V™, InfectoVac Flu™ or Invivac™ during the 2006-2007 influenza season.

The above is a clinical trial exclusion criterion. Annotated with entity spans:
Administration of the licensed [Drug: MF59-containing vaccines], e.g. [Drug: Fluad]™ or [Drug: Addigrip]™ or [Drug: virosome-based influenza vaccines] such as [Drug: Inflexal V]™, [Drug: InfectoVac Flu]™ or [Drug: Invivac]™ [Temporal: during the 2006-2007 influenza season].